type 2 diabetic, age 18 and over, informed consent,

The above is a clinical trial inclusion criterion. Annotated with entity spans:
[Condition: type 2 diabetic], [Person: age] [Value: 18 and over], [Informed_consent: informed consent],